Clinical trial inclusion criterion:
Subjects who have previously undergone LASIK surgery

Annotated entities:
- Procedure: "LASIK surgery"
- Temporal: "previously"